Asistimos en Urgencias a una mujer de 87 años hipertensa, diabética y con insuficiencia cardiaca clase D y un grado funcional basal 3-4 de la NYHA. En los últimos seis meses ingresó desde Urgencias en nuestro servicio 6 veces. La última vez fue un ingreso de evolución tórpida en la que se valoró su posible asistencia intensiva en UCI, pero se descartó dada su situación basal y el deseo de la paciente de evitar medidas de soporte de dudosa efectividad e invasivas. Acude nuevamente a las 48 horas tras el alta de su último ingreso por clínica de incremento de su disnea hasta grado 4 en el contexto de tos y expectoración purulenta. Se encuentra mal perfundida y su saturación con oxigenoterapia mediante mascarilla reservorio de O2 es de 85%. En relación con la actitud diagnóstica y terapéutica a adoptar es preciso tener cuenta que:
1. Es crucial el diagnóstico preciso e inmediato mediante TAC de tórax y obtención de muestras microbiológicas, incluso de carácter invasivo, para ajustar el tratamiento.
2. Dada la avanzada edad y situación clínica es recomendable la abstención terapéutica, “primun non nocere”, dado lo evolucionado del cuadro.
3. Es fundamental definir explícitamente los objetivos terapéuticos, simplificándolos y evitando tratamientos innecesarios, así como respetar los valores y preferencias del paciente y de su familia.
4. Se trata de una neumonía adquirida en la comunidad (NAC) de alto riesgo que precisa de tratamiento intensivo con soporte ventilatorio,     incluso      mecánico,    y antibioterapia de alto espectro por el riesgo de multirresistencia bacteriana.
5. Se trata de un proceso de fin de vida en situación agónica a quien prioritariamente se debe realizar sedación para paliar su sufrimiento.

Respuesta correcta: 3. Es fundamental definir explícitamente los objetivos terapéuticos, simplificándolos y evitando tratamientos innecesarios, así como respetar los valores y preferencias del paciente y de su familia.